下列關於氣喘（bronchial asthma）的治療敘述，何者正確？
A. 宜常規使用速效性乙二型交感神經增效劑（rapid acting β-agonist）來控制症狀
B. 使用中劑量吸入性類固醇而效果不佳時，應優先提高類固醇劑量來控制發炎反應
C. 使用吸入型長效性乙二型交感神經增效劑與吸入型類固醇合併製劑，可有效控制持續性氣喘（persistent asthma）
D. 白三烯酸拮抗劑（leukotriene antagonist）適用於重度持續性氣喘（severe persistent asthma）

正確答案：C. 使用吸入型長效性乙二型交感神經增效劑與吸入型類固醇合併製劑，可有效控制持續性氣喘（persistent asthma）